Acute bacterial endocarditis

The above is a clinical trial exclusion criterion. Annotated with entity spans:
[Condition: Acute bacterial endocarditis]